Clinical trial exclusion criterion:
eye diseases or pathologies that prevent clear ophthalmoscopy and evaluation of study parameters, thus not allowing study participation according to the investigator´s judgment, such as (but not only) vitreous hemorrhage, mature cataract, macular pathologies other than diabetic maculopathy

Entity relations:
- Has_negation("ophthalmoscopy", "prevent")
- Has_negation("diabetic maculopathy", "other")
- OR("vitreous hemorrhage", "mature cataract", "macular pathologies")